Clinical trial exclusion criterion:
Use of PPI or NSAID in the past 4 weeks

Entity relations:
- Has_temporal("PPI", "in the past 4 weeks")
- OR("PPI", "NSAID")